有一病患胸部 X-ray 檢查發現肺臟出現硬幣狀病灶（稱為"coin-like lesions＂），用犬心絲蟲  （Dirofilaria immitis）抗原檢查血清抗體呈陽性反應，下列敘述何者錯誤？
A. 該病患可以被診斷為感染犬心絲蟲
B. 該病患在晚上採血可以檢查到微絲蟲（microfilariae）
C. 該病患居家附近可能有感染犬心絲蟲的狗
D. 該病患可能會有咳嗽、胸痛但很少咳血

正確答案：B. 該病患在晚上採血可以檢查到微絲蟲（microfilariae）